Clinical trial exclusion criterion:
Contraindication for prescription of Firmagon®

Entity relations:
- AND("Contraindication", "Firmagon")